Clinical trial inclusion criterion:
The participant is an outpatient of either sex aged >= 30 and < 80 years.

Annotated entities:
- Person: "aged"
- Value: ">= 30 and < 80 years"